Clinical trial exclusion criterion:
Chronic alcohol taker

Annotated entities:
- Qualifier: "Chronic"
- Person: "alcohol taker"